Clinical trial exclusion criterion:
Can not cooperate with the treatment

Annotated entities:
- Observation: "cooperate with the treatment"
- Negation: "not"